Clinical trial inclusion criterion:
Women be at least 18 years of age

Annotated entities:
- Person: "Women"
- Value: "at least 18 years"
- Person: "age"